下列何者不是構成 Waldeyer's ring 的一部分？
A. 歐氏管開口周圍的淋巴組織（Gerlach's tonsil）
B. 腺樣體（adenoid）
C. 舌扁桃（lingual tonsil）
D. Virchow's node

正確答案：D. Virchow's node